Clinical trial exclusion criterion:
History of thrombocytopenia or neutropenia

Entity relations:
- Has_temporal("thrombocytopenia", "History")
- OR("thrombocytopenia", "neutropenia")